Patients with chronic and acute inflammatory conditions such as sepsis, rheumatoid arthritis, ectopic dermatitis, asthma, ulcerative colitis.

The above is a clinical trial exclusion criterion. Annotated with entity spans:
Patients with [Qualifier: chronic] and [Qualifier: acute] [Condition: inflammatory conditions] such as [Condition: sepsis], [Condition: rheumatoid arthritis], [Condition: ectopic dermatitis], [Condition: asthma], [Condition: ulcerative colitis].